patients with infected miscarriage/abortion (presence of fever, pus from the cervix, leukocytosis [> 14000]);

The above is a clinical trial exclusion criterion. Annotated with entity spans:
patients with [Qualifier: infected] [Condition: miscarriage]/[Condition: abortion] (presence of [Condition: fever], [Condition: pus from the cervix], [Measurement: leukocytosis] [[Temporal: > 14000]]);